Is a nursing or pregnant female, or intends to become pregnant within 6 months after receiving trial medication

The above is a clinical trial exclusion criterion. Annotated with entity spans:
Is a [Condition: nursing] or [Condition: pregnant] [Person: female], or [Mood: intends to become] [Condition: pregnant] [Temporal: within 6 months after receiving trial medication]